有關肺部復健的功效，下列何者效果最不能期待？
A. 可增加運動耐力
B. 改善患者健康相關生活品質
C. 減少病患呼吸困難的不適感
D. 使病患的肺功能檢查數據（如 FEV1）回復正常

正確答案：D. 使病患的肺功能檢查數據（如 FEV1）回復正常